Clinical trial inclusion criterion:
Age 18-65

Entity relations:
- Has_value("Age", "18-65")